一位 35 歲女性病人，已生二子，目前服用避孕藥，健康檢查及多次在家自量血壓介於 138/88 mmHg mmHg 之間。身體診查及健診檢驗皆為正常。下列處置何者最為恰當？
A. 給予利尿劑治療高血壓
B. 給予鈣離子阻斷劑治療高血壓
C. 請病人和其婦產科醫師討論是否停止服用避孕藥，並定期測血壓及回診
D. 給予 angiotensin-converting enzyme inhibitor（ACEI）治療高血壓

正確答案：C. 請病人和其婦產科醫師討論是否停止服用避孕藥，並定期測血壓及回診